1. Individuals scheduled for undergoing colonoscopy at the Endoscopy Center of Wuxi people's Hospital in China

The above is a clinical trial inclusion criterion. Annotated with entity spans:
[Parsing_Error: 1.] Individuals [Non-query-able: scheduled for undergoing] [Procedure: colonoscopy] at the [Visit: Endoscopy Center of Wuxi people's Hospital in China]